下列那一種Staphylococcal enterotoxin最易導致pseudomembranous enterocolitis？
A. Enterotoxin A
B. Enterotoxin B
C. Enterotoxin C
D. Enterotoxin D

正確答案：B. Enterotoxin B